下列何者不是急性發炎之併發症及後遺症變化？
A. 組織疤痕化
B. 膿瘍形成
C. 惡性變化
D. 慢性發炎

正確答案：C. 惡性變化